NO generan potenciales de acción:
1. Fibras musculares lisas.
2. Neuronas bipolares de la retina.
3. Fibras musculares estriadas esqueléticas.
4. Fibras musculares cardíacas.
5. Neuronas ganglionares de la retina.

Respuesta correcta: 2. Neuronas bipolares de la retina.